Clinical trial exclusion criterion:
Subject has hypertrophic cardiomyopathy.

Annotated entities:
- Condition: "hypertrophic cardiomyopathy"